Clinical trial exclusion criterion:
Patients affected by metabolic or thyroid disorders;

Entity relations:
- OR("metabolic disorders", "thyroid disorders")